43歲女性主訴昨天開始肚臍周圍疼痛，今天疼痛轉移到右下腹來，同時合併嘔吐、噁心，她就到急診來看診，她最有可能是什麼問題？
A. 憩室炎
B. 闌尾炎
C. 卵巢炎
D. 腸胃炎

正確答案：B. 闌尾炎